The ability to comprehend and comply with protocol requirements.

The above is a clinical trial inclusion criterion. Annotated with entity spans:
[Post-eligibility: The ability to comprehend and comply with protocol requirements].